Clinical trial exclusion criterion:
History of major organ transplantation with an existing functional graft.

Entity relations:
- Has_qualifier("major organ transplantation", "existing functional graft")